When was galcanezumab approved by FDA?

Galcanezumab was approved by the FDA in September 2018.